Clinical trial inclusion criterion:
Patients that have elected to have a nerve block

Entity relations:
- Has_mood("nerve block", "elected to have")